Clinical trial exclusion criterion:
Anticipated postoperative positive pressure ventilation

Entity relations:
- Has_temporal("positive pressure ventilation", "postoperative")
- Has_mood("positive pressure ventilation", "Anticipated")